Clinical trial inclusion criterion:
2. Diagnosis of venous leg ulcer(s), as clinically determined by the investigator by a positive venous reflux test (venous refilling <20 seconds) using Doppler ultrasound for at least 4 weeks prior to screening day, which have not adequately responded to conventional ulcer therapy.

Annotated entities:
- Parsing_Error: "2."
- Condition: "venous leg ulcer(s)"
- Measurement: "venous reflux test"
- Value: "positive"
- Measurement: "venous refilling"
- Value: "<20 seconds"
- Procedure: "Doppler ultrasound"
- Temporal: "at least 4 weeks prior to screening day"
- Reference_point: "screening day"
- Observation: "responded"
- Negation: "not"
- Qualifier: "adequately"
- Procedure: "conventional ulcer therapy"